7. Ankle brachial pressure index <0.65

The above is a clinical trial exclusion criterion. Annotated with entity spans:
[Parsing_Error: 7.] [Measurement: Ankle brachial pressure index] [Value: <0.65]